Clinical trial exclusion criterion:
Self-identified history of hypoglycemia

Entity relations:
- Has_temporal("hypoglycemia", "history")
- Has_qualifier("hypoglycemia", "Self-identified")